Clinical trial inclusion criterion:
at least two symptoms of UTI (dysuria, urgency of micturition, frequency, lower abdominal pain)

Annotated entities:
- Condition: "symptoms of UTI"
- Multiplier: "at least two"
- Condition: "dysuria"
- Condition: "urgency of micturition"
- Condition: "frequency"
- Condition: "lower abdominal pain"